Clinical trial exclusion criterion:
Major surgery, other than diagnostic surgery, within 2 weeks.

Entity relations:
- Has_temporal("Major surgery", "within 2 weeks")
- AND("Major surgery", "diagnostic surgery")
- Has_negation("diagnostic surgery", "other than")